Clinical trial exclusion criterion:
Planned postoperative TSH goal other than 0.1-0.5 mU/L

Entity relations:
- Has_qualifier("TSH", "postoperative")
- Has_negation("0.1-0.5 mU/L", "other than")
- Has_value("TSH", "0.1-0.5 mU/L")